Clinical trial exclusion criterion:
age less than 13 years at time of procedure

Entity relations:
- Has_value("age", "less than 13 years")
- Has_temporal("age", "at time of procedure")